being <50% breastfed at the time of inclusion

The above is a clinical trial exclusion criterion. Annotated with entity spans:
being [Multiplier: <50%] [Observation: breastfed] [Temporal: at the time of inclusion]